經臨床使用藥物的分析調查後發現，小孩因病毒感染而使用某種藥物作為退燒時，易伴隨有Reye syndrome的副作用。下列何種藥物產生此副作用的可能性最高？
A. acetaminophen
B. aspirin
C. sulindac
D. ibuprofen

正確答案：B. aspirin